下列有關小腸惡性腫瘤之敘述，何者為誤？
A. 腺癌最多約占 50%，較高比率發生在空腸，且較常發生在年輕患者
B. 惡性腸胃組織間質瘤（GIST）約占 20%，大部分大於五公分，且有較高的細胞分裂係數，及侵犯黏膜固有層（Lamina propria）
C. 腸胃道的惡性淋巴瘤三分之一發生在小腸，是小孩常見的小腸惡性腫瘤，且較多發生在迴腸
D. 類癌（Carcinoid）較易發生在闌尾和終迴腸

正確答案：A. 腺癌最多約占 50%，較高比率發生在空腸，且較常發生在年輕患者